Clinical trial inclusion criterion:
Healthy patients (ASA I)

Annotated entities:
- Condition: "Healthy patients"
- Measurement: "ASA"
- Value: "I"